一對夫妻到門診作不孕症檢查，妻子 30 歲，月經週期正常，週期第 3 天 FSH 7.2 IU/L，雙側輸卵管通暢，先生的精蟲數目為 20 萬/mL，活動力 10%，先生的染色體為 46XY，無 Y chromosome  microdeletion。你會建議他們作何治療？
A. 人工受精（intrauterine insemination; IUI）
B. 傳統試管嬰兒（in vitro fertilization; IVF）
C. 細胞內精蟲顯微注射（intracytoplasmic sperm injection; ICSI）
D. 禮物嬰兒（gamete intrafallopian transfer; GIFT）

正確答案：C. 細胞內精蟲顯微注射（intracytoplasmic sperm injection; ICSI）